Clinical trial exclusion criterion:
Bloodpressure 150/95 or higher.

Entity relations:
- Has_value("Bloodpressure", "150/95 or higher")